Habitualmente protege al DNA de un enzima de restricción la:
1. Metilación de una base nitrogenada.
2. Glicosilación de una base nitrogenada.
3. Acetilación de la desoxirribosa.
4. Fosforilación de la desoxirribosa.
5. Pérdida de uno de los grupos hidroxilo del fosfato.

Respuesta correcta: 1. Metilación de una base nitrogenada.